Clinical trial exclusion criterion:
4. Claustrophobia;

Annotated entities:
- Condition: "Claustrophobia"